Clinical trial exclusion criterion:
Contraindication to the study medication.

Entity relations:
- AND("Contraindication", "study medication")